¿Cuál es el enfoque que propone el modelo de relación entre terapeuta y cliente como de experto a experto?:
1. El modelo conductual.
2. La perspectiva constructivista.
3. El psicoánalisis.
4. La escuela estratégica.
5. La terapia centrada en el cliente.

Respuesta correcta: 2. La perspectiva constructivista.